Clinical trial inclusion criterion:
scheduled for Nuss procedure for pectus excavatum correction

Annotated entities:
- Procedure: "Nuss procedure"
- Mood: "scheduled"
- Condition: "pectus excavatum"